Clinical trial exclusion criterion:
5. Pregnant female.

Annotated entities:
- Parsing_Error: "5."
- Person: "female"
- Condition: "Pregnant"